Clinical trial exclusion criterion:
Severe asthma exacerbation requiring resuscitation

Annotated entities:
- Condition: "asthma exacerbation"
- Procedure: "resuscitation"
- Qualifier: "Severe"